Where participation in the study would result in donation of blood or blood products in excess of 500 mL within a 90 day period.

The above is a clinical trial exclusion criterion. Annotated with entity spans:
[Non-query-able: Where participation in the study would result in donation of blood or blood products in excess of 500 mL within a 90 day period.]